Need for anterior surgery or for vertebral column resection.

The above is a clinical trial exclusion criterion. Annotated with entity spans:
[Mood: Need for] [Procedure: anterior surgery] or for [Procedure: vertebral column resection].